Abbreviated MDRD eGFR = 30 mL/min/1.73m2.

The above is a clinical trial inclusion criterion. Annotated with entity spans:
Abbreviated [Measurement: MDRD eGFR] [Value: = 30 mL/min/1.73m2].